Clinical trial exclusion criterion:
Medication: Immunosuppressive drugs, antibiotics in the past three months (before baseline appointment) )

Entity relations:
- Has_temporal("Immunosuppressive drugs", "in the past three months")
- Has_index("before baseline appointment", "baseline appointment")
- multi("baseline appointment", "baseline appointment")
- Has_temporal("Immunosuppressive drugs", "before baseline appointment")
- OR("Immunosuppressive drugs", "antibiotics")